Co-infection with hepatitis C virus, hepatitis D virus or human immunodeficiency virus (HIV)

The above is a clinical trial exclusion criterion. Annotated with entity spans:
[Condition: Co-infection] with [Qualifier: hepatitis C virus], [Qualifier: hepatitis D virus] or [Qualifier: human immunodeficiency virus] ([Qualifier: HIV])